El Conner Performance Test-II (CPT-II) (Conner, 2004) es un cuestionario destinado a medir:
1. La memoria.
2. La atención y la impulsividad.
3. La capacidad verbal y numérica.
4. La depresión.

Respuesta correcta: 2. La atención y la impulsividad.